Bare-metal stent implantation within 1 month prior to TAVI procedure;

The above is a clinical trial exclusion criterion. Annotated with entity spans:
[Device: Bare-metal stent] [Procedure: implantation] [Temporal: within 1 month prior to TAVI procedure];